La medida de prevención menos eficaz en la aparición de un brote de salmonelosis es:
1. La inmunización activa a la población de riesgo.
2. Lavado de manos riguroso y frecuente, así como de los utensilios y superficies que se van a utilizar para cocinar.
3. Mantener los alimentos en el refrigerador.
4. Cocinar los alimentos con temperatura suficiente (al menos 70ºC).
5. Refrigerado rápido de los alimentos cocinados.

Respuesta correcta: 1. La inmunización activa a la población de riesgo.